Which is the main gene signature in Systemic Lupus Erythematosus (SLE)?

SLE is characterized by dysregulation of both the innate and the adaptive immune systems. An increased expression of type I IFN-regulated genes, termed IFN signature, has been reported in patients with SLE.